Clinical trial inclusion criterion:
platelets ≥ 100 x109/L

Annotated entities:
- Measurement: "platelets"
- Value: "≥ 100 x109/L"